Clinical trial inclusion criterion:
9. Body weight > 30 kg

Entity relations:
- Has_value("Body weight", "> 30 kg")